Willingness and ability to attend scheduled follow-up visits and undergo study assessments.

The above is a clinical trial inclusion criterion. Annotated with entity spans:
Willingness and [Mood: ability to attend scheduled follow-up visits] and undergo study assessments.